Has a HLA-B27+ gene and 2 or more of the SpA characteristics listed above

The above is a clinical trial inclusion criterion. Annotated with entity spans:
Has a [Condition: HLA-B27+] gene and [Multiplier: 2 or more] of the [Condition: SpA] characteristics listed above